nursing

The above is a clinical trial exclusion criterion. Annotated with entity spans:
[Condition: nursing]